一位 22 歲女性，第一胎，懷孕 24 週，平常並沒有不適，在診所發現胎兒右側輕微腦水腫，轉來醫學中心門診檢查，請問安排下列何種檢查為最佳？
A. 全血檢查
B. 高層次超音波
C. 母血唐氏症篩檢
D. 母血糖尿病篩檢

正確答案：B. 高層次超音波